Clinical trial exclusion criterion:
Known renal failure or allergy to acetazolamide and other sulfonamides

Entity relations:
- AND("allergy", "acetazolamide")
- OR("acetazolamide", "other", "sulfonamides")
- OR("renal failure", "allergy")